Clinical trial exclusion criterion:
stimulant medications (eg, Ritalin, Concerta, Biphetamine, and Dexedrine)

Entity relations:
- AND("stimulant medications", "Ritalin")
- OR("Ritalin", "Concerta", "Biphetamine", "Dexedrine")